Clinical trial inclusion criterion:
Elective TNTS resection of Pituitary Tumor

Entity relations:
- AND("TNTS resection", "Pituitary Tumor")
- Has_qualifier("TNTS resection", "Elective")